Clinical trial inclusion criterion:
Ability to provide informed consent

Annotated entities:
- Informed_consent: "Ability to provide informed consent"